Clinical trial inclusion criterion:
Known history of Type 2 diabetes mellitus for >3 months

Annotated entities:
- Condition: "Type 2 diabetes mellitus"
- Value: ">3 months"